下列何者是革蘭氏陽性菌對 macrolide 抗生素產生抗藥性的主要機轉？
A. 減少甲基化酵素（methylase）之產生
B. 抑制乙醯轉移酵素的活性
C. 增加細胞膜對藥物的通透性
D. 改變 50S ribosome 次單位結合位置的結構

正確答案：D. 改變 50S ribosome 次單位結合位置的結構